Clinical trial exclusion criterion:
chest deformity;

Annotated entities:
- Condition: "chest deformity"